Clinical trial exclusion criterion:
Treatment with psychotropic medications in the 2 weeks prior to randomization with the exception of approved treatments for dementia (ChEIs and memantine), selective serotonin reuptake inhibitor antidepressants, and trazodone (if used as an aid to facilitate sleep and not as an antidepressant); other psychotropics (with the exclusion of antipsychotics), if stable for 3 months, may be allowed only with Steering Committee approval on a case by case basis. Note that antipsychotics are expressly prohibited.

Annotated entities:
- Drug: "psychotropic medications"
- Temporal: "in the 2 weeks prior to randomization"
- Reference_point: "randomization"
- Condition: "dementia"
- Procedure: "treatments for dementia"
- Drug: "ChEIs"
- Drug: "memantine"
- Drug: "selective serotonin reuptake inhibitor antidepressants"
- Drug: "trazodone"
- Negation: "with the exception of"
- Context_Error: "(if used as an aid to facilitate sleep and not as an antidepressant)"
- Drug: "other psychotropics"
- Drug: "antipsychotics"
- Negation: "with the exclusion of"
- Qualifier: "stable"
- Temporal: "for 3 months"